Clinical trial exclusion criterion:
Subjects who have systemic infection

Annotated entities:
- Condition: "systemic infection"